Clinical trial exclusion criterion:
Previous myocardial revascularization surgery with = 1 internal mammary or radial artery graft;

Entity relations:
- Has_temporal("myocardial revascularization surgery", "Previous")
- Has_multiplier("internal mammary graft", "= 1")
- AND("myocardial revascularization surgery", "internal mammary graft")
- OR("internal mammary graft", "radial artery graft")